En el caso de fobia a la oscuridad ¿Cómo se presenta el estímulo fóbico al niño en la prueba de tolerancia?:
1. Sin gradación, con elevada intensidad desde el principio.
2. Con gradación, de menor a mayor intensidad.
3. Sin gradación, con intensidad moderada desde el principio.
4. Con gradación, de mayor a menor intensidad.

Respuesta correcta: 1. Sin gradación, con elevada intensidad desde el principio.